Clinical trial inclusion criterion:
Evidence of diastolic dysfunction showing E/E' > 10

Annotated entities:
- Condition: "diastolic dysfunction"
- Measurement: "E/E'"
- Value: "> 10"